Clinical trial inclusion criterion:
Pregnancy or breastfeeding, or trying to conceive

Entity relations:
- OR("Pregnancy", "trying to conceive", "breastfeeding")